Subject with a history of prostatectomy because of prostate cancer, including nerve sparing techniques. Subjects with a history of surgical procedures for the treatment of benign prostate hypertrophy are permitted, with the exception of cryosurgery, cryotherapy or cryoablation

The above is a clinical trial exclusion criterion. Annotated with entity spans:
Subject with a history of [Procedure: prostatectomy] because of [Condition: prostate cancer], including [Procedure: nerve sparing techniques]. Subjects with a [Temporal: history of] [Procedure: surgical procedures] for the treatment of [Condition: benign prostate hypertrophy] are [Negation: permitted], [Negation: with the exception of] [Procedure: cryosurgery], [Procedure: cryotherapy] or [Procedure: cryoablation]